Which chromosome contains the TLR7 locus in the human genome?

The X chromosome. TLR7 is encoded on X chromosome XP22.